一位 75 歲的陳先生患有嚴重關節炎而長期服用鎮痛劑。日前，因排出黑便而入院檢查。結果，發現胃壁有 3 公分潰瘍及幽門螺旋桿菌（Helicobacter pylori）感染。陳先生胃潰瘍主因較可能是：
A. 胃黏膜障壁（mucosa barrier）受破壞
B. 胃排空（gastric empty）太慢
C. 鎮痛劑直接侵蝕胃壁
D. 螺旋桿菌引起胃蛋白酶（pepsin）大量分泌

正確答案：A. 胃黏膜障壁（mucosa barrier）受破壞